Clinical trial inclusion criterion:
Clinically suspected scrub typhus: defined as acute undifferentiated fever with no clear focus of infection and negative malaria blood smear and/or negative malaria RDT. Patients may have one, none, or a combination of other clinical findings such as eschar, rash, lymphadenopathy, headache, myalgia, cough, nausea and abdominal discomfort.

Entity relations:
- Has_negation("focus of infection", "no clear")
- Has_value("malaria blood smear", "negative")
- Has_value("malaria RDT", "negative")
- Has_multiplier("eschar", "one")
- Subsumes("scrub typhus", "acute undifferentiated fever")
- Subsumes("scrub typhus", "focus of infection")
- Subsumes("scrub typhus", "malaria blood smear")
- OR("malaria blood smear", "malaria RDT")
- OR("one", "none", "a combination of")
- OR("eschar", "rash", "lymphadenopathy", "headache", "myalgia", "cough", "nausea", "abdominal discomfort")